Peptic ulcers 的 surgical indications 中，何種 incidence 明顯降低？
A. intractability
B. hemorrhage
C. perforation
D. obstruction

正確答案：A. intractability